Clinical trial exclusion criterion:
History of previous surgery on the same knee

Entity relations:
- Has_qualifier("surgery", "knee")